Not available for follow-up

The above is a clinical trial exclusion criterion. Annotated with entity spans:
[Non-query-able: Not available for follow-up]